Clinical trial inclusion criterion:
Refractory to conservative treatment

Annotated entities:
- Procedure: "conservative treatment"
- Qualifier: "Refractory"